一名 60 歲婦女因意識不清和倦怠而住院，病人有糖尿病長期服用 metformin，去年被診斷罹患肺小細胞癌目前仍治療中。身體診查：血壓 136/80 mmHg，脈搏每分鐘 76 次，呼吸每分鐘 14 次，頸靜脈平坦，胸腹部無異常，四肢無水腫，神經學檢查無運動缺陷，唯 deep tendon reflexes 對稱性減弱。實驗室檢查：血鈉 108 mmol/L，鉀 3.8 mmol/L，HCO3- 24 mEq/L，尿素氮 5 mg/dL，肌酸酐 0.5 mg/dL，血清滲透壓 220 mOsmol/kg H2O，尿滲透壓 400 mOsmol/kg H2O。若太快校正此病人之電解質異常，最 擔心發生下列何種併發症？
A. 反彈性高血糖（rebound hyperglycemia）
B. 滲透性大腦去髓鞘症候群（osmotic cerebral demyelination）
C. 肺水腫（pulmonary edema）
D. 腦水腫（brain edema）

正確答案：B. 滲透性大腦去髓鞘症候群（osmotic cerebral demyelination）